Clinical trial inclusion criteria:
Male or female = 18 years of age at Visit 1.
Sweat chloride equal or greater than 60 mEq/L by quantitative pilocarpine iontophoresis test.
Two well-characterized mutations in the cystic fibrosis transmembrane conductance regulator (CFTR) gene
Abnormal nasal potential difference (NPD) as measured by a change in NPD in response to a low chloride solution and isoproterenol of less than -5 mV.
Documentation of the presence of an acute pulmonary exacerbation, based on CF Foundation guidelines, as diagnosed by a faculty member of the Denver Adult CF Program.
Respiratory culture(s) demonstrating evidence of Pseudomonas aeruginosa or Achromobacter species airway infection.
Subject is able to produce sputum, undergo phlebotomy, and provide written consent.
The subject's treating physician has determined that they should receive either tobramycin or colistin intravenously as one of the designated agents for their APE treatment. Subjects who are able to receive either tobramycin or colistin as part of their antibiotic regimen will be randomized into one of three arms. If a treating physician deems that a subject cannot receive tobramycin due to vestibular toxicity, ototoxicity or bacterial resistance, the subject will be randomized to either standard or PK-adjusted colistin.

Annotated entities:
- Person: "Male"
- Person: "female"
- Person: "age"
- Temporal: "at Visit 1."
- Reference_point: "Visit 1"
- Value: "= 18 years"
- Measurement: "Sweat chloride"
- Value: "equal or greater than 60 mEq/L"
- Measurement: "quantitative pilocarpine iontophoresis test"
- Multiplier: "Two"
- Condition: "mutations"
- Condition: "cystic fibrosis transmembrane conductance regulator gene"
- Condition: "CFTR"
- Measurement: "nasal potential difference"
- Measurement: "NPD"
- Value: "Abnormal"
- Value: "less than -5 mV"
- Non-query-able: "as measured by a change in NPD in response to a low chloride solution and isoproterenol of"
- Condition: "acute pulmonary exacerbation"
- Measurement: "CF Foundation guidelines"
- Non-query-able: "as diagnosed by a faculty member of the Denver Adult CF Program"
- Measurement: "Respiratory culture(s)"
- Value: "Pseudomonas aeruginosa"
- Value: "Achromobacter species"
- Condition: "airway infection"
- Post-eligibility: "Subject is able to produce sputum, undergo phlebotomy, and provide written consent."
- Post-eligibility: "The subject's treating physician has determined that they should receive either tobramycin or colistin intravenously as one of the designated agents for their APE treatment. Subjects who are able to receive either tobramycin or colistin as part of their antibiotic regimen will be randomized into one of three arms. If a treating physician deems that a subject cannot receive tobramycin due to vestibular toxicity, ototoxicity or bacterial resistance, the subject will be randomized to either standard or PK-adjusted colistin"